Clinical trial exclusion criterion:
Patients with sepsis or active infection.

Annotated entities:
- Condition: "sepsis"
- Condition: "active infection"